Clinical trial inclusion criterion:
Male or female patients 2 to 16 years of age

Annotated entities:
- Person: "Male"
- Person: "female"
- Value: "2 to 16 years"
- Person: "age"